下列關於 cardia cancer 之 surgical treatment 的敘述，何者錯誤？
A. 和 proximal gastrectomy 比較，total gastrectomy 為 procedure of choice
B. proximal gastrectomy 比 total gastrectomy 有較高 morbidity 及 mortality
C. proximal gastrectomy 比 total gastrectomy 有較高的 heartburn 發生率
D. prognosis 比 distal gastric cancer 佳

正確答案：D. prognosis 比 distal gastric cancer 佳